study drug hypersensitivity

The above is a clinical trial exclusion criterion. Annotated with entity spans:
[Drug: study drug] [Condition: hypersensitivity]